下列何者為骨盆橫膈的一部分？
A. 梨狀肌
B. 提肛肌
C. 閉孔內肌
D. 會陰淺橫肌

正確答案：B. 提肛肌